戒菸的人尼古丁戒斷症狀，下列敘述何者正確？
A. 心跳減慢
B. 食慾下降
C. 血壓上升
D. 戒斷症狀在戒菸後4至6小時內達高峰

正確答案：A. 心跳減慢